Clinical trial exclusion criterion:
Contraindication for adalimumab

Annotated entities:
- Condition: "Contraindication"
- Drug: "adalimumab"